Clinical trial exclusion criterion:
Pregnancy (Self-reported)

Entity relations:
- AND("Pregnancy", "Self-reported")